Patients <65 years of age

The above is a clinical trial exclusion criterion. Annotated with entity spans:
Patients [Value: <65 years] of [Person: age]